先天性多囊腎（Congenital polycystic kidney）的致病原因可能是：
A. 輸尿管芽退化
B. 收集管閉鎖
C. 輸尿管受到壓迫
D. 近曲腎小管發育不良

正確答案：D. 近曲腎小管發育不良